Clinical trial exclusion criterion:
Child-Pugh score > 12

Annotated entities:
- Measurement: "Child-Pugh score"
- Value: "> 12"